Clinical trial inclusion criterion:
Able to be randomized prior to or up to 48 hours after surgery.

Annotated entities:
- Non-representable: "Able to be randomized prior to or up to 48 hours after surgery."